Clinical trial inclusion criterion:
Suffer from schizophrenia/schizoaffective disorder meeting Diagnostic and Statistical Manual of Mental Disorders, Fourth Edition, Text Revision (DSM-IV-TR) criteria;

Annotated entities:
- Condition: "schizophrenia"
- Condition: "schizoaffective disorder"
- Measurement: "Diagnostic and Statistical Manual of Mental Disorders, Fourth Edition, Text Revision"
- Measurement: "DSM-IV-TR"